RIF (repeated implantation failure), defined as greater than or equals to (>=) 2 previous failed embryo transfers

The above is a clinical trial exclusion criterion. Annotated with entity spans:
[Condition: RIF (repeated implantation failure)], defined as [Value: greater than or equals to (>=) 2] [Measurement: previous failed embryo transfers]